左右髂骨嵴（iliac crest）最高點的水平連線通過下列何者的棘突（spinous process）？
A. L2
B. L3
C. L4
D. L5

正確答案：C. L4